Which deiodinase polymorphisms are implicated in arterial hypertension?

Two deiodinase polymorphisms are implicated in arterial hypertension: Ala92 type 2 deiodinase allele and rs7140952 polymorphism of DIO2